Clinical trial exclusion criterion:
History of hypersensitivity or allergy to any of the study drugs, drugs of similar chemical classes, ACE inhibitors (ACEIs), angiotensin II receptor blockers (ARBs), or neprilysin inhibitors, as well as known or suspected contraindications to the study drugs.

Annotated entities:
- Condition: "hypersensitivity"
- Condition: "allergy"
- Drug: "study drugs"
- Non-representable: "rugs of similar chemical classes"
- Drug: "ACE inhibitors (ACEIs)"
- Drug: "angiotensin II receptor blockers (ARBs)"
- Drug: "neprilysin inhibitors"
- Condition: "contraindications"
- Mood: "known"
- Mood: "suspected"
- Drug: "study drugs"